Chronic hepatitis B,

The above is a clinical trial inclusion criterion. Annotated with entity spans:
[Condition: Chronic hepatitis B],